Clinical trial inclusion criterion:
BMI = 35

Annotated entities:
- Measurement: "BMI"
- Value: "= 35"